Clinical trial inclusion criterion:
Habitual dietary sodium intake > 3400mg per day

Annotated entities:
- Measurement: "dietary sodium intake"
- Value: "> 3400mg per day"